Clinical trial exclusion criterion:
Patients with Multiple Sclerosis.

Annotated entities:
- Condition: "Multiple Sclerosis"